Clinical trial inclusion criterion:
aged 18 to 40 years.

Entity relations:
- Has_value("aged", "18 to 40 years")